the subjects have completed the basic immunization of 2 needle recombinant hepatitis B vaccine, there is no inoculation history of EV71 vaccine, and no history of EV71 infection

The above is a clinical trial inclusion criterion. Annotated with entity spans:
the subjects have completed the basic immunization of [Multiplier: 2] [Drug: needle recombinant hepatitis B vaccine], there is [Negation: no] [Procedure: inoculation] [Temporal: history] of [Drug: EV71 vaccine], and [Negation: no] [Temporal: history] of [Condition: EV71 infection]